Clinical trial exclusion criterion:
Known hypersensitivity to tetracycline, doxycycline or azithromycin

Annotated entities:
- Condition: "hypersensitivity"
- Drug: "tetracycline"
- Drug: "doxycycline"
- Drug: "azithromycin"